病人因嚴重類風濕關節炎導致劇痛就醫，就診時告知其為一牧師，因為要主持巡迴佈道，故要求你開立最有效的止痛藥。類固醇是一種消炎效力極強的藥物，常用於風濕性疾病的短期給藥，但因其與胰島素存有藥品交互作用，可能會促進糖質新生而誘發或加重糖尿病的病情，嚴重者更可能導致死亡，故在開立類固醇時，應特別注意患者是否有糖尿病史。病人顯然具有豐富的醫學知識，雖然告知你有糖尿病病史，仍要求你開給他類固醇藥物，他表示站在維護其神職人員堅強健全形象且期望專心投身工作的立場，即使類固醇治療最壞結果是導致死亡亦不後悔，下列可能的作法，那一個最符合倫理？
A. 既然這個病人如此要求，基於尊重病人自主權，就照他的意思開給他類固醇藥物，反正是病人自己的健康，應該自己負責
B. 自主原則雖然重要，但不傷害原則也是醫學倫理的重要精神，所以為了兩全其美，騙這個病人是開類固醇藥物，但其實是給另外藥效雖然較不明顯，但也不會傷害病人的其他止痛藥物
C. 不傷害原則誠然重要，正直誠實也很重要，所以直接告訴病人你沒有辦法在明知對病人有害的情況下開立類固醇給他，請他接受你的建議或另覓良醫
D. 病人的選擇顯然違反病人自己的最大利益，所以要更深入地與病人溝通，釐清病人真正的問題癥結，了解病人對糖尿病以及對類固醇的看法，再與病人共同討論出一個最能達到病人心願的治療方案

正確答案：D. 病人的選擇顯然違反病人自己的最大利益，所以要更深入地與病人溝通，釐清病人真正的問題癥結，了解病人對糖尿病以及對類固醇的看法，再與病人共同討論出一個最能達到病人心願的治療方案